Clinical trial inclusion criterion:
Mild to moderate tear film dysfunction clinical diagnose

Entity relations:
- Has_qualifier("tear film dysfunction", "Mild")
- OR("Mild", "moderate")